Un hombre de 70 años se debe someter a una cirugía de extracción de cataratas. Tiene una prótesis mecánica mitral desde hace 10 años y está en tratamiento con acenocumarol. El electrocardiograma muestra un ritmo sinusal. ¿Cuál de las siguientes recomendaciones le parece más adecuada?
1. Realizar la cirugía ocular sin suspender el acenocumarol.
2. Suspender el acenocumarol 5 días antes de la cirugía y reiniciarlo el día posterior a la misma.
3. Suspender el acenocumarol 5 días antes de la cirugía, iniciar heparina de bajo peso molecular 3 días antes de la cirugía y suspenderla 24 horas antes de la misma.
4. Suspender el acenocumarol 1 día antes de la intervención y utilizar plasma fresco congelado durante la misma.
5. Suspender el acenocumarol 1 día antes de la intervención y dar vitamina K justo antes de la misma.

Respuesta correcta: 1. Realizar la cirugía ocular sin suspender el acenocumarol.